19. Known intolerance to study drugs.

The above is a clinical trial exclusion criterion. Annotated with entity spans:
[Parsing_Error: 19.] Known [Context_Error: intolerance to study drugs].